Clinical trial exclusion criterion:
Had change of anti-TNF agent or DMARD in the last 6 months

Entity relations:
- AND("change", "anti-TNF agent")
- Has_temporal("change", "in the last 6 months")
- OR("anti-TNF agent", "DMARD")